Clinical trial inclusion criterion:
10. The target lesion(s) is (are) de novo or restenotic (including in-stent restenotic) native coronary artery lesion(s) with greater than 50 and less than 100% stenosis (visual estimate), or the target lesion is an acute (less than 1 month) total occlusion as evidenced by clinical symptoms.

Annotated entities:
- Qualifier: "de novo"
- Condition: "target lesion"
- Qualifier: "restenotic"
- Qualifier: "in-stent restenotic"
- Condition: "coronary artery lesion"
- Value: "greater than 50 and less than 100%"
- Measurement: "stenosis"
- Condition: "stenosis"
- Condition: "target lesion"
- Temporal: "acute"
- Temporal: "less than 1 month"
- Condition: "total occlusion"
- Observation: "clinical symptoms"